Clinical trial exclusion criterion:
Hypersensitivity to ticagrelor

Entity relations:
- AND("Hypersensitivity", "ticagrelor")